Clinical trial exclusion criterion:
Seropositivity for human immunodeficiency virus (HIV)

Entity relations:
- Subsumes("human immunodeficiency virus", "HIV")
- Has_value("human immunodeficiency virus", "Seropositivity")